Clinical trial exclusion criterion:
St.p. surgery with opening the uterine cavity (incl. caesarean section)

Annotated entities:
- Condition: "St.p."
- Procedure: "surgery with opening the uterine cavity"
- Procedure: "caesarean section"